Clinical trial inclusion criterion:
Age 18 or older

Annotated entities:
- Person: "Age"
- Value: "18 or older"